3. Signed the informed consent

The above is a clinical trial inclusion criterion. Annotated with entity spans:
3. [Informed_consent: Signed the informed consent]